Clinical trial exclusion criterion:
additional acupuncture

Annotated entities:
- Procedure: "acupuncture"